En el tratamiento de los pacientes afectos de enfermedad de Alzheimer, ¿cuál de las siguientes opciones terapéuticas considera más adecuada?
1. Es de elección el tratamiento inicial de cualquier tipo de incontinencia urinaria con fármacos como la oxibutinina, por sus efectos anticolinérgicos.
2. El tratamiento con inhibidores de la acetilcolinesterasa.
3. Para el tratamiento de la depresión asociada priorizar la utilización de antidepresivos tricíclicos.
4. Los neurolépticos típicos a dosis elevadas.
5. La terapia de reemplazo con estrógenos.

Respuesta correcta: 2. El tratamiento con inhibidores de la acetilcolinesterasa.